以下關於醫療機構／醫院分類的敘述何者錯誤？
A. 依所有權分為公立醫療機構、私立醫療機構、醫療法人及法人附設醫療機構四類
B. 依主治醫師雇用方式分為開放性醫院及閉鎖性醫院兩類
C. 依服務項目分為醫院、診所及其他醫療機構三類
D. 依是否具教學功能分為教學醫院及非教學醫院兩類

正確答案：B. 依主治醫師雇用方式分為開放性醫院及閉鎖性醫院兩類